Clinical trial inclusion criterion:
Patients diagnosed severe sepsis / septic shock at admission on Intensive Care Unit who can be enrolled within 90 min after admission OR patients diagnosed severe sepsis / septic shock during Intensive Care Unit stay who can be enrolled within 90 min after diagnosis

Entity relations:
- Has_temporal("septic shock", "at admission on Intensive Care Unit")
- Has_temporal("severe sepsis", "at admission on Intensive Care Unit")
- Has_index("at admission on Intensive Care Unit", "admission on Intensive Care Unit")
- OR("severe sepsis", "septic shock")